Clinical trial exclusion criterion:
Women of childbearing age without reliable contraception

Entity relations:
- Has_negation("contraception", "without")
- OR("reliable", "contraception")